Clinical trial exclusion criterion:
10. Pregnant women or women with reproductive potential who are sexually active and not using an acceptable form of contraception.

Annotated entities:
- Parsing_Error: "10."
- Condition: "Pregnant"
- Person: "women"
- Person: "women"
- Condition: "reproductive potential"
- Condition: "sexually active"
- Condition: "contraception"
- Qualifier: "acceptable form of"
- Subjective_judgement: "acceptable form of"
- Negation: "not"